構成 VLDL、IDL 及 LDL 的表面蛋白 Apo B-100，由下列何者分泌？
A. 內臟脂肪
B. 肝
C. 腸
D. 骨骼肌

正確答案：B. 肝